Poor ovarian response (POR) according to the European Society of Human Reproduction and Embryology (ESHRE) Criteria

The above is a clinical trial exclusion criterion. Annotated with entity spans:
[Condition: Poor ovarian response (POR)] according to the [Qualifier: European Society of Human Reproduction and Embryology (ESHRE) Criteria]